人類早期懷孕的流產之中，最重要的原因是：
A. 環境及藥物因素
B. 母親子宮因素
C. 母親內分泌因素
D. 胚胎品質不佳

正確答案：D. 胚胎品質不佳